要診斷有症狀之多囊性腎病（polycystic kidney disease）及篩選（screen）家人是否有此病，最方便的方法為那一種？
A. 核磁共振（MRI）
B. 電腦斷層（CT scan）
C. 超音波（sonography）
D. 基因分析（gene linkage analysis）

正確答案：C. 超音波（sonography）